今年 60 歲的楊伯伯一年前因胃癌住院接受手術治療，最近被證實已有復發且轉移至肺部，預計存活時間剩下約只有半年。在獲知這個壞消息之後，楊伯伯要求醫師不要告知他新婚半年的外籍太太實際的病情，因為楊伯伯騙她在一年前是因胃潰瘍開刀而未告知自己罹患癌症的真相，怕她知道後會不諒解而離棄他。下列是醫師向楊伯伯的回應，其中何者最為合宜？
A. 指出楊太太有權知道真相，故醫師在楊太太詢問時會據實以告
B. 告知應由楊伯伯自己向太太坦白承認，但如果楊太太有詢問的話，也不會幫助隱瞞
C. 表示理解楊伯伯，但誠實才是正確之途，指導楊伯伯一些溝通的技巧
D. 同意隱瞞並教導如何與楊太太作應對

正確答案：C. 表示理解楊伯伯，但誠實才是正確之途，指導楊伯伯一些溝通的技巧